利用早期分泌抗原標的-6（ESAT-6）及培養過濾蛋白-10（CFP-10），做為抗原以偵測病患的T細胞所產生的丙型干擾素（IFN-γ），其目的是檢	病患受到下列那一種微生物的感染？
A. 立氏立克次體（Rickettsia rickettsii）
B. 煙麴霉菌（Aspergillus fumigatus）
C. 肺炎黴漿菌（Mycoplasma pneumoniae）
D. 結核分枝桿菌（Mycobacterium tuberculosis）

正確答案：D. 結核分枝桿菌（Mycobacterium tuberculosis）